Clinical trial inclusion criterion:
Symptomatic primary knee osteoarthritis with failed conservative treatment at least 3 months

Entity relations:
- Has_qualifier("osteoarthritis", "knee")
- Has_qualifier("osteoarthritis", "primary")
- Has_qualifier("osteoarthritis", "Symptomatic")
- Has_qualifier("conservative treatment", "failed")
- Has_temporal("conservative treatment", "at least 3 months")